Inability to exercise or undertake a MRP

The above is a clinical trial exclusion criterion. Annotated with entity spans:
[Negation: Inability] to [Observation: exercise] or undertake a [Procedure: MRP]